Airway anomalies;

The above is a clinical trial exclusion criterion. Annotated with entity spans:
[Condition: Airway anomalies];